Subjects were able to comply with the protocol and the restrictions and assessments therein.

The above is a clinical trial inclusion criterion. Annotated with entity spans:
[Post-eligibility: Subjects were able to comply with the protocol and the restrictions and assessments therein.]